What is the reason for the abundance of operons in the genome of C. elegans?

Our data shows that transcription proceeds in some ways as if operons were composed of multiple adjacent single genes. Recent hypothesis proposes that operons provide an evolutionary advantage via the conservation of machinery during recovery from growth arrested states.